Clinical trial inclusion criterion:
2. Has a diagnosis of WHO Group 1 PAH.

Entity relations:
- Has_value("WHO Group", "1")
- AND("PAH", "WHO Group")